What is marked by DNaseI hypersensitive sites?

Mapping DNaseI hypersensitive sites is commonly used to identify regulatory regions in the genome.